Clinical trial exclusion criterion:
Known serious hypersensitivity to other parenteral iron products

Entity relations:
- AND("hypersensitivity", "parenteral iron products")
- Has_qualifier("hypersensitivity", "serious")